Clinical trial exclusion criterion:
patients under legal custody,

Annotated entities:
- Person: "legal custody"